Serious hematologic disease (e.g. CML, MDS)

The above is a clinical trial exclusion criterion. Annotated with entity spans:
[Qualifier: Serious] [Condition: hematologic disease] (e.g. [Condition: CML], [Condition: MDS])